15. Pregnant or nursing patients

The above is a clinical trial exclusion criterion. Annotated with entity spans:
[Parsing_Error: 15.] [Condition: Pregnant] or [Condition: nursing] patients